Clinical trial exclusion criterion:
Unstable or uncooperative patients

Annotated entities:
- Condition: "uncooperative patients"
- Condition: "Unstable patients"